Clinical trial exclusion criterion:
Current Moderate or Severe Substance Use Disorder, other than Alcohol, Nicotine or Caffeine Use Disorders

Entity relations:
- Has_qualifier("Substance Use Disorder", "Moderate")
- Has_temporal("Substance Use Disorder", "Current")
- Has_negation("Alcohol Use Disorders", "other than")
- AND("Substance Use Disorder", "Alcohol Use Disorders")
- OR("Moderate", "Severe")
- OR("Alcohol Use Disorders", "Nicotine Use Disorders", "Caffeine Use Disorders")